「漿細胞（plasma cell）」具有下列何種特徵？
A. 細胞核是扁平形，常位於細胞中央
B. 細胞內有許多平滑內質網（smooth endoplasmic reticulum）
C. 是由 T 淋巴球（T lymphocyte）分化而成
D. 分布在脾的脾索（splenic cord）

正確答案：D. 分布在脾的脾索（splenic cord）